下列何者不會造成內八字步態（in-toeing gait）？
A. metatarsal adductus
B. planovalgus foot
C. medial tibial torsion
D. hyperanteversion of hip

正確答案：B. planovalgus foot